En cromatografía líquida en columna la fuerza eluyente o poder de elución de una fase móvil es de gran importancia. En este contexto:
1. En una fase móvil formada por una mezcla de agua y modificador orgánico (cromatografía en fase inversa), cuanto menor sea su contenido en modificador mayor será su fuerza eluyente.
2. Un disolvente B tendrá mayor fuerza eluyente que otro A si un soluto tiene un factor de retención menor en la misma columna cuando se emplea B como fase móvil que cuando se emplea A.
3. Los eluyentes se clasifican en fuertes y débiles, según que su fuerza eluyente sea baja o alta, respectivamente.
4. En cromatografía de líquidos en fase inversa, cualquier modificador orgánico es un disolvente débil en comparación con el agua.

Respuesta correcta: 2. Un disolvente B tendrá mayor fuerza eluyente que otro A si un soluto tiene un factor de retención menor en la misma columna cuando se emplea B como fase móvil que cuando se emplea A.